下列何者慢性中毒時會發生齒齦發炎與牙齒脫落的毒性作用？
A. Tetraethyl lead
B. Mercury vapor
C. Trivalent arsenic
D. Iron

正確答案：B. Mercury vapor